history of allergic disease or reactions likely to be exacerbated by any component of the vaccine

The above is a clinical trial exclusion criterion. Annotated with entity spans:
history of [Condition: allergic disease] or reactions likely to be [Qualifier: exacerbated by any component of the vaccine]